Clinical trial inclusion criterion:
Failure of medical treatment for at least 3 months.

Annotated entities:
- Procedure: "medical treatment"
- Observation: "Failure"
- Multiplier: "for at least 3 months"